Clinical trial inclusion criterion:
Indication for Fresh Embryo transfer

Annotated entities:
- Mood: "Indication for"
- Procedure: "Fresh Embryo transfer"